Inflammatory arthritis patients who plan to treat with biological agents, including Humira or Enbrel or Simponi or Orencia or Mabthera or Actemra; as first line biologic treatment is indicated.

The above is a clinical trial inclusion criterion. Annotated with entity spans:
[Condition: Inflammatory arthritis] patients who plan to treat with [Procedure: biological agents], including [Drug: Humira] or [Drug: Enbrel] or [Drug: Simponi] or [Drug: Orencia] or [Drug: Mabthera] or [Drug: Actemra]; as first line biologic treatment is indicated.